Clinical trial exclusion criterion:
2. Pulmonary veno-occlusive disease and/or pulmonary capillary hemangiomatosis

Annotated entities:
- Parsing_Error: "2."
- Condition: "Pulmonary veno-occlusive disease"
- Undefined_semantics: "Pulmonary veno-occlusive disease"
- Condition: "pulmonary capillary hemangiomatosis"